13. Subject has active sepsis.

The above is a clinical trial exclusion criterion. Annotated with entity spans:
13. Subject has [Temporal: active] [Condition: sepsis].